Clinical trial exclusion criterion:
Subject with a diagnosis of gastroparesis or small bowel or large bowel dysmotility.

Entity relations:
- OR("gastroparesis", "large bowel dysmotility", "small bowel")